inflammatory arthritis including rheumatoid arthritis

The above is a clinical trial exclusion criterion. Annotated with entity spans:
[Condition: inflammatory arthritis] including [Condition: rheumatoid arthritis]